Clinical trial exclusion criterion:
St.p. cervical tear

Entity relations:
- AND("St.p.", "cervical tear")